關於抗病毒藥物acyclovir之敘述，下列何者正確？
A. 為adenosine衍生物
B. 須被宿主細胞之thymidine kinase加入第一個磷酸根後才易被活化產生藥效
C. 只會作用於被病毒感染細胞，不會影響其他正常細胞
D. 用於治療人類免疫缺乏病毒（human immunodeficiency virus）感染所引起之疾病

正確答案：C. 只會作用於被病毒感染細胞，不會影響其他正常細胞